Clinical trial exclusion criterion:
Already taking Metformin or any other drug intended to treat diabetes

Annotated entities:
- Drug: "Metformin"
- Drug: "drug"
- Qualifier: "diabetes"